Clinical trial exclusion criterion:
Exclusion criteria are pregnancy, patients with contraindications to regional anesthesia, allergy to LAs, patients taking opioids regularly due to chronic pain, use of anticoagulation drugs other than acetylsalicylic acid or dipyridamole, atrioventricular block, diabetes.

Annotated entities:
- Condition: "pregnancy"
- Condition: "contraindications"
- Procedure: "regional anesthesia"
- Condition: "allergy"
- Drug: "LAs"
- Drug: "opioids"
- Multiplier: "regularly"
- Condition: "chronic pain"
- Drug: "anticoagulation drugs"
- Drug: "acetylsalicylic acid"
- Drug: "dipyridamole"
- Condition: "atrioventricular block"
- Condition: "diabetes"
- Negation: "other than"